下列何者最常出現沙狀瘤小體（psammoma bodies）？
A. 腎上腺皮質瘤
B. 副甲狀腺瘤
C. 甲狀腺乳頭癌
D. 胰臟腺癌

正確答案：C. 甲狀腺乳頭癌